Clinical trial inclusion criterion:
Fertile men and women of childbearing potential must agree to use an effective method of birth control from providing signed consent and for 120 days after last study drug administration. Women of childbearing potential include pre-menopausal women and women within the first 2 years of the onset of menopause. Women of childbearing potential must have a negative pregnancy test ≤ 72 hours prior to Day 1 of study.

Annotated entities:
- Person: "women"
- Person: "men"
- Condition: "childbearing potential"
- Procedure: "birth control"
- Temporal: "from providing signed consent"
- Reference_point: "providing signed consent"
- Temporal: "for 120 days after last study drug administration"
- Reference_point: "last study drug administration"
- Non-query-able: "Fertile men and women of childbearing potential must agree to use an effective method of birth control from providing signed consent and for 120 days after last study drug administration."
- Non-query-able: "Women of childbearing potential include pre-menopausal women and women within the first 2 years of the onset of menopause."
- Person: "Women"
- Condition: "childbearing potential"
- Condition: "pre-menopausal"
- Person: "women"
- Person: "women"
- Temporal: "within the first 2 years of the onset of menopause"
- Reference_point: "the onset of menopause"
- Condition: "childbearing potential"
- Person: "Women"
- Measurement: "pregnancy test"
- Value: "negative"
- Temporal: "≤ 72 hours prior to Day 1"
- Reference_point: "Day 1"